ASA Physical Status II - III

The above is a clinical trial inclusion criterion. Annotated with entity spans:
[Measurement: ASA Physical Status] [Value: II - III]